Discharged from hospital following non-trauma related admission

The above is a clinical trial inclusion criterion. Annotated with entity spans:
[Procedure: Discharged from hospital] following [Procedure: non-trauma related admission]